Clinical trial inclusion criterion:
Patient is willing to be randomized and participate.

Annotated entities:
- Post-eligibility: "Patient is willing to be randomized and participate"